脊髓之白質主要組成為何？
A. neuronal soma
B. dendrites
C. connective tissue
D. myelinated axons

正確答案：D. myelinated axons